Normal cognitive function in order to sign written, informed consent and to understand trial protocol

The above is a clinical trial inclusion criterion. Annotated with entity spans:
[Value: Normal] [Measurement: cognitive function] in order to sign written, informed consent and to understand trial protocol